因急性闌尾炎於 1 個月前接受闌尾切除手術，術後右下腹部原來開刀切口的皮膚摸到一個小結節，顯微鏡檢查可見巨噬細胞、淋巴球、漿細胞及多核巨細胞，同時也出現偏光折射性物質。下列何者最適合解釋上述結節情況？
A. 皮膚結核菌感染
B. 傷口感染引起的膿瘍
C. 縫線引起的肉芽腫
D. 手術引起的蟹足腫（Keloid）

正確答案：C. 縫線引起的肉芽腫